Clinical trial inclusion criterion:
no contra-indication for medical induction of labor

Annotated entities:
- Condition: "contra-indication"
- Negation: "no"
- Procedure: "medical induction of labor"